Participants must have English fluency sufficient to complete study measures.

The above is a clinical trial inclusion criterion. Annotated with entity spans:
P[Non-query-able: articipants must have English fluency sufficient to complete study measures].